Which disease is included as an additional feature in the Goldberg-Shprintzen syndrome?

Hirschsprung disease is very often identified as an additional feature of the Goldberg-Shprintzen syndrome.